Clinical trial exclusion criterion:
Known hypersensitivity to tetracycline, doxycycline or azithromycin

Entity relations:
- AND("hypersensitivity", "tetracycline")
- OR("tetracycline", "azithromycin", "doxycycline")